Clinical trial inclusion criterion:
ASA 1 & 2

Annotated entities:
- Measurement: "ASA"
- Value: "1 & 2"